What disease is associated with mutations in the MECP2 transcription factor?

Mutations in the MECP2 transcription factor, which encodes the cellular iron exporter ferroportin, are associated with Rett syndrome.